關於老年人接受主要手術（major surgery）時，下列敘述何者錯誤？
A. 有心肌缺血心臟病並有抽菸，在手術前後期可使用乙型阻斷劑（β-blocker）
B. 老年人發生無症狀菌尿症（bacteriuria）的機率比較高，手術前應檢查尿液
C. 雖然老年人有糖尿病的比率較高，但是高血糖（hyperglycemia）並不會增加手術的發病率和死亡率（morbidity and
D. 老年人在手術前應評估其肺部功能

正確答案：C. 雖然老年人有糖尿病的比率較高，但是高血糖（hyperglycemia）並不會增加手術的發病率和死亡率（morbidity and